Clinical trial exclusion criterion:
Ongoing bleeding

Annotated entities:
- Temporal: "Ongoing"
- Condition: "bleeding"